Clinical trial exclusion criterion:
Non-infectious or autoimmune keratitis

Entity relations:
- OR("Non-infectious keratitis", "autoimmune keratitis")